Clinical trial exclusion criterion:
serum phosphorus <2.2mg/dl, osteoporosis

Annotated entities:
- Measurement: "serum phosphorus"
- Value: "<2.2mg/dl"
- Condition: "osteoporosis"